(relative) Contraindications for photodynamic treatment (pregnancy, porphyria, severely disturbed liver function). Pregnancy will not be routinely tested in female patients, but the possibility of pregnancy will be discussed during screening

The above is a clinical trial exclusion criterion. Annotated with entity spans:
(relative) [Condition: Contraindications] for [Procedure: photodynamic treatment] ([Condition: pregnancy], [Condition: porphyria], [Qualifier: severely] [Condition: disturbed liver function]). [Non-representable: Pregnancy will not be routinely tested in female patients, but the possibility of pregnancy will be discussed during screening]